Any comparable successor IPG (MRI conditional system, BSCI) compatible with

The above is a clinical trial inclusion criterion. Annotated with entity spans:
Any [Qualifier: comparable] [Device: successor IPG] ([Device: MRI conditional system], [Device: BSCI]) compatible with